¿Qué núcleo del hipotálamo es el responsable de regular la conducta sexual en hembras?:
1. Ventromedial.
2. Supraquiasmático.
3. Paraventricular.
4. Preóptico medial.
5. Dorsomedial.

Respuesta correcta: 1. Ventromedial.